Clinical trial exclusion criterion:
Subjects with autoimmune diseases.

Annotated entities:
- Condition: "autoimmune diseases"